Ability to provide diagnostic reports

The above is a clinical trial inclusion criterion. Annotated with entity spans:
[Non-query-able: Ability to provide diagnostic reports]